Clinical trial inclusion criterion:
MADRS score > 20

Entity relations:
- Has_value("MADRS score", "> 20")